下列何者的栓塞（thrombosis）最可能會導致左側睪丸（testis）腫脹？
A. 左陰部內靜脈（left internal pudendal vein）
B. 下腔靜脈（inferior vena cava）
C. 左陰部外靜脈（left external pudendal vein）
D. 左腎靜脈（left renal vein）

正確答案：D. 左腎靜脈（left renal vein）